Body Mass Index (BMI) of 17.5 to 30.5 kg/m2; and a total body weight >50 kg (110 lbs).

The above is a clinical trial inclusion criterion. Annotated with entity spans:
[Measurement: Body Mass Index (BMI)] of [Value: 17.5 to 30.5 kg/m2]; and a [Measurement: total body weight] [Value: >50 kg (110 lbs)].